Clinical trial inclusion criterion:
Fasting glucose < 7,0 mM, HbA1c < 48 mmol/mol 3 months after RYGB

Entity relations:
- multi("RYGB", "RYGB")
- Has_index("3 months after RYGB", "RYGB")
- Has_value("HbA1c", "< 48 mmol/mol")
- Has_value("Fasting glucose", "< 7,0 mM")
- Has_temporal("Fasting glucose", "3 months after RYGB")
- OR("Fasting glucose", "HbA1c")